Clinical trial inclusion criterion:
(2) Body mass index (BMI):20-29.

Annotated entities:
- Measurement: "Body mass index"
- Measurement: "BMI"
- Value: "20-29"